Clinical trial exclusion criterion:
Patients with any contraindications or hypersensitivity related to antiplatelet therapy

Annotated entities:
- Condition: "contraindications"
- Condition: "hypersensitivity"
- Procedure: "antiplatelet therapy"